Clinical trial exclusion criterion:
6. Patient has preexisting sphincter problems or evidence of extensive local disease in the pelvis.

Annotated entities:
- Condition: "sphincter problems"
- Condition: "local disease in the pelvis"
- Qualifier: "extensive"
- Mood: "evidence of"